Allergic reaction to poultry or previous viscosupplementation

The above is a clinical trial exclusion criterion. Annotated with entity spans:
[Condition: Allergic reaction] to [Observation: poultry] or previous [Observation: viscosupplementation]